El “Test de la Figura Humana” (DAP) es una técnica de evaluación proyectiva:
1. Estructural.
2. Temática.
3. Asociativa.
4. Expresiva.

Respuesta correcta: 4. Expresiva.